Clinical trial inclusion criterion:
Expanded Disability Status Scale (EDSS) score less than equals to (<=) 5.0.

Annotated entities:
- Measurement: "Expanded Disability Status Scale (EDSS) score"
- Value: "less than equals to (<=) 5.0"